Clinical trial inclusion criteria:
Subjects age 21 and older
Subjects with healthy eyes
Subjects who have previously undergone LASIK surgery
Subjects with residual refractive error.

Annotated entities:
- Value: "21 and older"
- Person: "age"
- Condition: "healthy eyes"
- Procedure: "LASIK surgery"
- Temporal: "previously"
- Condition: "residual refractive error"